Which molecule is targeted by Asciminib?

Asciminib is an orally administered allosteric inhibitor of the BCR-ABL tyrosine kinase.